Moderate to severe OSA

The above is a clinical trial inclusion criterion. Annotated with entity spans:
[Qualifier: Moderate to severe] [Condition: OSA]